Clinical trial exclusion criterion:
HbA1c greater than 75 mmol/mol (9.0%)

Entity relations:
- Subsumes("greater than 75 mmol/mol", "9.0%")
- Has_value("HbA1c", "greater than 75 mmol/mol")